high likelihood of poor adherence to PREP and clinic attendance

The above is a clinical trial exclusion criterion. Annotated with entity spans:
[Post-eligibility: high likelihood of poor adherence to PREP and clinic attendanc]e